What is the role of Adamts18 in hormone receptor signaling?

In vitro, ADAMTS18 cleaves fibronectin; in vivo, it causes increased collagen deposition during adolescence, which results in impaired Hippo signaling and reduced Fgfr2 expression both in vitro and in vivo. Importantly, it is required for stem cell activation, has multiple binding partners in the basement membrane, and interacts genetically with the basal membrane-specific proteoglycan, Col18a1, pointing to the caveolae of stem cells as part of the stem cell niche.